Pregnant or nursing (lactating) women.

The above is a clinical trial exclusion criterion. Annotated with entity spans:
[Condition: Pregnant] or [Observation: nursing] ([Observation: lactating]) [Person: women].